Clinical trial inclusion criterion:
female subjects who are heterosexually active and of childbearing potential (i.e., not surgically sterile or at least two years post menopausal) must practice contraception as follows from screening through completion of the study:

Annotated entities:
- Person: "female"
- Condition: "heterosexually active"
- Condition: "childbearing potential"
- Condition: "surgically sterile"
- Procedure: "surgically"
- Negation: "not"
- Temporal: "at least two years"
- Condition: "post menopausal"
- Procedure: "contraception"
- Pregnancy_considerations: "female subjects who are heterosexually active and of childbearing potential (i.e., not surgically sterile or at least two years post menopausal) must practice contraception as follows from screening through completion of the study:"
- Parsing_Error: "female subjects who are heterosexually active and of childbearing potential (i.e., not surgically sterile or at least two years post menopausal) must practice contraception as follows from screening through completion of the study:"